Clinical trial exclusion criterion:
Cancer within the last 5 years except prostate cancer and surgically removed basal or squamous cell carcinoma of the skin

Annotated entities:
- Condition: "Cancer"
- Temporal: "last 5 years"
- Negation: "except"
- Condition: "prostate cancer"
- Condition: "squamous cell carcinoma of the skin"
- Condition: "basal cell carcinoma of the skin"
- Procedure: "surgically"